Clinical trial exclusion criterion:
Subjects who require a legally authorized representative to obtain consent

Annotated entities:
- Non-query-able: "Subjects who require a legally authorized representative to obtain consent"